Clinical trial exclusion criterion:
Evidence of pre-existing fetal anomalies incompatible with the child's life

Annotated entities:
- Condition: "fetal anomalies"